Clinical trial inclusion criterion:
Age greater than or equal to 18 years

Annotated entities:
- Person: "Age"
- Value: "greater than or equal to 18 years"